contraindications to epidural analgesia

The above is a clinical trial exclusion criterion. Annotated with entity spans:
[Condition: contraindications] to [Procedure: epidural analgesia]